Clinical trial inclusion criterion:
Absence of skin injures, infections or tumor in the target knee;

Entity relations:
- Has_negation("skin injures", "Absence")
- Has_index("tumor", "target knee")
- Has_index("infections", "target knee")
- OR("skin injures", "infections", "tumor")